下列何種藥物可減少levodopa被周邊組織的decarboxylase代謝，降低levodopa的使用劑量及副作用？
A. carbidopa
B. ropinirole
C. amantadine
D. benztropine

正確答案：A. carbidopa